Clinical trial inclusion criterion:
Any intramuscular or intravenous corticosteroid injection within 2 weeks before baseline

Annotated entities:
- Procedure: "corticosteroid injection"
- Qualifier: "intravenous"
- Qualifier: "intramuscular"
- Temporal: "within 2 weeks before baseline"
- Reference_point: "baseline"